Clinical trial exclusion criterion:
Less than 2-year disease free from another primary malignancy (other than squamous or basal cell carcinoma of the skin, "in-situ" carcinoma of the cervix or breast, superficial bladder carcinoma, or previously treated localized prostate cancer with normal prostate specific antigen (PSA) levels). Patients who have had completed all anti-cancer treatment for another primary malignancy more than 2 years prior to screening are eligible if they are not considered to have a "currently active" malignancy based on having less than a 30% risk of relapse.

Annotated entities:
- Temporal: "Less than 2-year"
- Condition: "disease free"
- Condition: "primary malignancy"
- Qualifier: "another"
- Condition: "squamous or basal cell carcinoma of the skin"
- Condition: ""in-situ" carcinoma of the cervix"
- Condition: ""in-situ" carcinoma of the cervix breast"
- Condition: "superficial bladder carcinoma"
- Condition: "localized prostate cancer"
- Measurement: "prostate specific antigen (PSA) levels"
- Value: "normal"
- Procedure: "anti-cancer treatment"
- Condition: "primary malignancy"
- Qualifier: "another"
- Temporal: "more than 2 years prior"
- Reference_point: "screening"
- Negation: "are eligible"
- Negation: "other than"